Clinical trial exclusion criterion:
The patient's data will be excluded if they die within 3 days of hospital admission.

Annotated entities:
- Observation: "die"
- Temporal: "within 3 days of hospital admission"
- Reference_point: "hospital admission"